Clinical trial inclusion criterion:
3. Male or female with a diagnosis of PBC, by at least two of the following criteria:

Entity relations:
- Has_multiplier("following criteria", "at least two")
- OR("Male", "female")